Clinical trial exclusion criterion:
Pancreatitis

Annotated entities:
- Condition: "Pancreatitis"